Clinical trial exclusion criterion:
Current systemic infection

Annotated entities:
- Condition: "systemic infection"